En qué tipo de tumor óseo maligno existe una translocación cromosómica 11/22t en más del 90% de los casos:
1. Osteosarcoma.
2. Mieloma.
3. Sarcoma de Ewing.
4. Condrosarcoma.

Respuesta correcta: 3. Sarcoma de Ewing.